Clinical trial inclusion criterion:
1) histologically confirmed (patients not receiving a single sputum cytology diagnosis) non-small cell lung cancer patients,with wild-type EGFR and ALK-negative; 2) According to IASLC2009 new TNM staging of lung cancer stage <U+2162>B or <U+2163>, previously untreated or relapsed after 1 year of lung cancer resection; 3) have at least one evaluable lesions,according to version 1.1 of the standard in accordance with a judgment RECIST(longest diameter on a spiral CT at least 10mm,on a regular CT longest diameter at least 20mm); 4) Male or female, aged 18 to 75 years; 5) ECOG PS 0 or 1; 6) expected survival at least 3 months; 7) adequate hematological function: absolute neutrophil count (ANC) at least 2×10^9/L and platelet count at least 100×10^9/L and hemoglobin at least 9 g/dL; 8) adequate liver function: total bilirubin less than upper limit of normal (ULN); AST and ALT less than 2.5 times upper limit of normal (ULN); alkaline phosphatase less than 5 times the upper limit of normal (ULN); 9) adequate renal function: serum creatinine less than upper limit of normal (ULN) or calculated creatinine clearance at least 60 mL/min; 10) ECG is normal, there is no non-healing wounds on the body; 11) had not received previous treatment anticancer drugs, or had only received for previous non-metastatic tumors adjuvant or neoadjuvant chemotherapy, but when you start to study treatment has ended more than 6 months; 12) have conducted previous surgery patients required to study treatment was started more than four weeks, and the patient had recovered; 13) have an intact uterus in women prior to enrollment in the study must have a negative pregnancy test result (unless it is already 24 months of amenorrhea) within 28 days. If the pregnancy test from the first administration more than seven days, urine pregnancy test is required for authentication (less than 7 days before the first dose); 14) previous to biological agents, particularly E.coli genetically engineered products without serious allergic reactions; 15) signed informed consent.

Annotated entities:
- Qualifier: "histologically confirmed"
- Condition: "non-small cell lung cancer"
- Qualifier: "wild-type EGFR"
- Qualifier: "ALK-negative"
- Measurement: "IASLC2009 new TNM staging"
- Condition: "lung cancer"
- Value: "stage <U+2162>B or <U+2163>"
- Qualifier: "untreated"
- Qualifier: "relapsed"
- Temporal: "after 1 year of lung cancer resection"
- Reference_point: "lung cancer resection"
- Multiplier: "at least one"
- Condition: "evaluable lesions"
- Measurement: "longest diameter"
- Procedure: "spiral CT"
- Value: "at least 10mm"
- Procedure: "regular CT"
- Measurement: "longest diameter"
- Value: "at least 20mm"
- Person: "Male"
- Person: "female"
- Person: "aged"
- Value: "18 to 75 years"
- Measurement: "ECOG PS"
- Value: "0 or 1"
- Observation: "expected survival"
- Temporal: "at least 3 months"
- Condition: "adequate hematological function"
- Measurement: "absolute neutrophil count (ANC)"
- Value: "at least 2×10^9/L"
- Measurement: "platelet count"
- Value: "at least 100×10^9/L"
- Measurement: "hemoglobin"
- Value: "at least 9 g/dL"
- Condition: "adequate liver function"
- Measurement: "total bilirubin"
- Value: "less than upper limit of normal (ULN)"
- Measurement: "AST"
- Measurement: "ALT"
- Value: "less than 2.5 times upper limit of normal (ULN)"
- Measurement: "alkaline phosphatase"
- Value: "less than 5 times the upper limit of normal (ULN)"
- Condition: "adequate renal function"
- Measurement: "serum creatinine"
- Value: "less than upper limit of normal (ULN)"
- Measurement: "calculated creatinine clearance"
- Value: "at least 60 mL/min"
- Measurement: "ECG"
- Value: "normal"
- Negation: "no"
- Condition: "non-healing wounds on the body"
- Drug: "anticancer drugs"
- Negation: "not received"
- Condition: "non-metastatic tumors"
- Qualifier: "neoadjuvant"
- Qualifier: "adjuvant"
- Procedure: "chemotherapy"
- Temporal: "ended more than 6 months"
- Temporal: "previous"
- Non-representable: "have conducted previous surgery patients required to study treatment was started more than four weeks, and the patient had recovered"
- Pregnancy_considerations: "have an intact uterus in women prior to enrollment in the study must have a negative pregnancy test result (unless it is already 24 months of amenorrhea) within 28 days. If the pregnancy test from the first administration more than seven days, urine pregnancy test is required for authentication (less than 7 days before the first dose);"
- Non-query-able: "signed informed consent."
- Non-representable: "previous to biological agents, particularly E.coli genetically engineered products without serious allergic reactions;"
- Line: "15) signed informed consent."
- Line: "14) previous to biological agents, particularly E.coli genetically engineered products without serious allergic reactions;"
- Line: "have an intact uterus in women prior to enrollment in the study must have a negative pregnancy test result (unless it is already 24 months of amenorrhea) within 28 days. If the pregnancy test from the first administration more than seven days, urine pregnancy test is required for authentication (less than 7 days before the first dose);"
- Line: "12) have conducted previous surgery patients required to study treatment was started more than four weeks, and the patient had recovered;"
- Line: "11) had not received previous treatment anticancer drugs, or had only received for previous non-metastatic tumors adjuvant or neoadjuvant chemotherapy, but when you start to study treatment has ended more than 6 months"
- Line: "ECG is normal, there is no non-healing wounds on the body;"
- Line: "adequate renal function: serum creatinine less than upper limit of normal (ULN) or calculated creatinine clearance at least 60 mL/min;"
- Line: "adequate liver function: total bilirubin less than upper limit of normal (ULN); AST and ALT less than 2.5 times upper limit of normal (ULN); alkaline phosphatase less than 5 times the upper limit of normal (ULN)"
- Line: "adequate hematological function: absolute neutrophil count (ANC) at least 2×10^9/L and platelet count at least 100×10^9/L and hemoglobin at least 9 g/dL"
- Line: "expected survival at least 3 months;"
- Line: "Male or female, aged 18 to 75 years; 5) ECOG PS 0 or 1"
- Line: "have at least one evaluable lesions,according to version 1.1 of the standard in accordance with a judgment RECIST(longest diameter on a spiral CT at least 10mm,on a regular CT longest diameter at least 20mm)"
- Line: "According to IASLC2009 new TNM staging of lung cancer stage <U+2162>B or <U+2163>, previously untreated or relapsed after 1 year of lung cancer resection"
- Line: "histologically confirmed (patients not receiving a single sputum cytology diagnosis) non-small cell lung cancer patients,with wild-type EGFR and ALK-negative;"